Clinical trial inclusion criterion:
Age 18-65 years

Entity relations:
- Has_value("Age", "18-65 years")